18 years or older patients who are proven to be infected by Helicobacter pylori based on positive in Urea Breath Test or positive in histopathologic examination of biopsy in antrum and corpus of gaster through esophagoduodenoscopy.

The above is a clinical trial inclusion criterion. Annotated with entity spans:
[Value: 18 years or older] patients who are proven to be [Condition: infected by Helicobacter pylori] based on [Value: positive] in [Measurement: Urea Breath Test] or [Value: positive] in [Procedure: histopathologic examination of biopsy] in [Qualifier: antrum] and [Qualifier: corpus of gaster] through [Procedure: esophagoduodenoscopy].